Patient is able to read understand and singe an inform consent.

The above is a clinical trial inclusion criterion. Annotated with entity spans:
Patient is [Observation: able to read] [Observation: understand] and [Observation: singe] an inform consent.